一位 酒的病人有神經病變、肌肉無力、心臟肥大、水腫，給予下列何種維生素最可能對病情有幫助？
A. thiamine
B. riboflavin
C. niacin
D. folate

正確答案：A. thiamine